Clinical trial inclusion criterion:
Agreement to the trial protocol, including the randomized manner

Annotated entities:
- Post-eligibility: "Agreement to the trial protocol, including the randomized manner"